Clinical trial inclusion criterion:
American Society of Anesthesiologist physical status 1-3

Annotated entities:
- Measurement: "American Society of Anesthesiologist physical status"
- Value: "1-3"